一位接受腹股溝疝氣修復的病人，於腰椎麻醉後，需要給予鎮靜-安眠類的藥物以加強麻醉作用。藥物給予後，病人出現意識喪失、眼睛睜開、眼球震顫之症狀，卻有良好的鎮靜止痛效果。請問給予病人的是何種藥物？
A. thiopental
B. ketamine
C. midazolam
D. flumazenil

正確答案：B. ketamine